Age = 18 years and NYHA (New York Heart Association) functional class II, III and IV

The above is a clinical trial inclusion criterion. Annotated with entity spans:
[Person: Age] [Value: = 18 years] and [Measurement: NYHA (New York Heart Association) functional class] [Value: II, III and IV]